Previously documented evidence of Pure Red Cell Aplasia (PRCA)

The above is a clinical trial exclusion criterion. Annotated with entity spans:
Previously documented evidence of [Condition: Pure Red Cell Aplasia] ([Condition: PRCA])